Actively wheezing at time of enrollment or history of asthma complications

The above is a clinical trial exclusion criterion. Annotated with entity spans:
Actively [Condition: wheezing] [Temporal: at time of enrollment] or history of [Condition: asthma complications]